Clinical trial inclusion criterion:
Histologically confirmed locally advanced gastric (primary endpoint includes proximal and mid-body stomach) or esophagogastric adenocarcinoma; distal gastric (antral) adenocarcinomas are eligible for enrolment but will not be included in the primary analysis

Annotated entities:
- Condition: "esophagogastric adenocarcinoma"
- Condition: "adenocarcinoma gastric"
- Qualifier: "locally advanced"
- Qualifier: "mid-body stomach"
- Qualifier: "proximal stomach"
- Condition: "adenocarcinomas"
- Qualifier: "distal gastric"
- Qualifier: "antral"
- Non-query-able: "are eligible for enrolment but will not be included in the primary analysis"